在毛囊（hair follicle）的橫切面中看到①內根鞘（internal root sheath） ②外根鞘（external root sheath） ③髓質 （medulla） ④皮質（cortex） ⑤玻璃膜（glassy membrane）等構造，這些構造由內而外依序為：
A. ①→②→③→④→⑤
B. ①→③→②→④→⑤
C. ③→①→②→④→⑤
D. ③→④→①→②→⑤

正確答案：D. ③→④→①→②→⑤